Clinical trial exclusion criterion:
Known pregnancy and/or lactation, or intent to become pregnant during this study.

Annotated entities:
- Pregnancy_considerations: "Known pregnancy and/or lactation, or intent to become pregnant during this study."